En el tratamiento farmacológico de las alucinaciones y los delirios, ¿cuál es la respuesta correcta?
1. Entre un 30-50% de personas con psicosis tratadas con antipsicóticos continúan presentando dificultades derivadas de los síntomas clínicos.
2. Los antipsicóticos actúan sobre los síntomas positivos de la psicosis, pero principalmente eliminan los síntomas negativos.
3. Los efectos secundarios extrapiramidales que provocan son intratables.
4. Cuando un antipsicótico no mejora los síntomas, cambiar el tratamiento no es aconsejable.
5. Es aconsejable no combinarlo con el tratamiento psicológico hasta que no hayan desaparecido los síntomas psicóticos.

Respuesta correcta: 1. Entre un 30-50% de personas con psicosis tratadas con antipsicóticos continúan presentando dificultades derivadas de los síntomas clínicos.